A life expectancy (assessed by investigator) of less than 6 months or is no longer capable of taking medication orally.

The above is a clinical trial exclusion criterion. Annotated with entity spans:
A [Observation: life expectancy] (assessed by investigator) of [Value: less than 6 months] or [Non-query-able: is no longer capable of taking medication orally].